以下何種情形，不能作為潛在性生物恐怖攻擊流行病學的線索？
A. 定點通報有多名病患產生類似症狀時
B. 疾病嚴重度較一般疾病輕微
C. 不尋常的疾病地理分布或季節（尤其在缺乏適當媒介時）
D. 同時或連續的爆發疫病時

正確答案：B. 疾病嚴重度較一般疾病輕微